Clinical trial inclusion criterion:
Males or females above the age of 18

Entity relations:
- Has_value("age", "above the age of 18")
- OR("Males", "females")